Clinical trial exclusion criterion:
Received heart transplantation or pacemaker implantation; revascularization treatment within 3 months; or plan to receive above treatment in 6 months.

Entity relations:
- Has_temporal("heart transplantation", "within 3 months")
- Has_mood("heart transplantation", "plan to")
- Has_temporal("heart transplantation", "in 6 months")
- Has_temporal("heart transplantation", "within 3 months")
- Has_mood("heart transplantation", "plan to")
- Has_temporal("heart transplantation", "in 6 months")
- OR("heart transplantation", "pacemaker implantation", "revascularization", "revascularization")
- OR("heart transplantation", "pacemaker implantation")
- OR("heart transplantation", "heart transplantation")
- OR("heart transplantation", "heart transplantation")